Clinical trial inclusion criterion:
Participants able and willing to comply with all aspects of the study, including a standardized, reduced calorie diet and an age appropriate, increased physical activity program

Entity relations:
- Has_qualifier("reduced calorie diet", "standardized")
- Has_qualifier("increased physical activity program", "age appropriate")
- Has_context("willing to comply", "reduced calorie diet")
- AND("willing to comply", "able to comply")